腦中風病患到院時兩眼同時看向右側，下列何者最可能受破壞？
A. 右側paramedian pontine reticular formation（PPRF）
B. 右側大腦半球之額葉（frontal lobe）
C. 右側動眼神經（oculomotor nerve）
D. 右側上丘（superior colliculus）

正確答案：B. 右側大腦半球之額葉（frontal lobe）